Clinical trial exclusion criterion:
LVEF < 1 UNL

Annotated entities:
- Measurement: "LVEF"
- Value: "< 1 UNL"